下肢的內側迴旋股動脈（medial circumflex femoral artery）與外側迴旋股動脈（lateral circumflex femoral artery）是下列何者的直接分支？
A. 股動脈（femoral artery）
B. 深股動脈（deep femoral artery）
C. 前者是股動脈（femoral artery），後者是深股動脈（deep femoral artery)
D. 前者是深股動脈（deep femoral artery），後者是股動脈（femoral artery）

正確答案：B. 深股動脈（deep femoral artery）